Clinical trial inclusion criterion:
Affiliation to the French social security regime or a similar regime.

Annotated entities:
- Non-query-able: "Affiliation to the French social security regime or a similar regime"